Histopathological verification of glioblastoma multiforme (GBM: WHO grade IV) in remission (Group A) or with active disease (Group B).

The above is a clinical trial inclusion criterion. Annotated with entity spans:
[Observation: Histopathological verification] of [Condition: glioblastoma multiforme] ([Condition: GBM]: [Measurement: WHO] [Value: grade IV]) [Qualifier: in remission] ([Qualifier: Group A]) or [Qualifier: with active disease] ([Qualifier: Group B]).